Clinical trial exclusion criterion:
Subject with known history of intestinal obstruction or current obstructive symptoms, such as severe abdominal pain with accompanying nausea or vomiting, based on investigator judgment.

Annotated entities:
- Condition: "intestinal obstruction"
- Temporal: "history"
- Condition: "obstructive symptoms"
- Temporal: "current"
- Condition: "severe abdominal pain"
- Condition: "nausea"
- Condition: "vomiting"